Clinical trial exclusion criterion:
contraindications for trial drugs

Annotated entities:
- Mood: "contraindications for"
- Drug: "drugs"
- Qualifier: "trial"